Clinical trial inclusion criterion:
uncontrolled concomitant medical conditions that may compromise to chemotherapy

Entity relations:
- Has_temporal("medical conditions that may compromise to chemotherapy", "concomitant")
- Has_qualifier("medical conditions that may compromise to chemotherapy", "uncontrolled")